previous UTI in the past 2 weeks

The above is a clinical trial exclusion criterion. Annotated with entity spans:
previous [Condition: UTI] in the [Temporal: past 2 weeks]